Clinical trial inclusion criterion:
Patients must have adequate organ function as defined by the following laboratory criteria:

Entity relations:
- Has_value("organ function", "adequate")
- multi("adequate organ function", "organ function")